Clinical trial exclusion criteria:
Patients will not be included if they have reached a stable dose of warfarin, liver dysfunction, alcoholism, use of another anticoagulant, use of chemotherapy, or if they do not meet the inclusion criteria

Annotated entities:
- Multiplier: "stable dose"
- Drug: "warfarin"
- Condition: "liver dysfunction"
- Condition: "alcoholism"
- Qualifier: "another"
- Drug: "anticoagulant"
- Procedure: "chemotherapy"
- Post-eligibility: "if they do not meet the inclusion criteria"